Clinical trial inclusion criterion:
No significant disease or drug use

Entity relations:
- Has_qualifier("disease", "significant")
- Has_negation("disease", "No")
- OR("disease", "drug use")